在小腸上皮細胞中，鈉離子（Na+）不與下列何者共同吸收？
A. 胺基酸（amino acid）
B. 碳酸氫根（bicarbonate）
C. 半乳糖（galactose）
D. 葡萄糖（glucose）

正確答案：B. 碳酸氫根（bicarbonate）